Which gene is responsible for proper speech development?

Transcription factor forkhead box protein p2 plays an essential role in the development of language and speech.The key regulator for language and speech development , foxp2 , is a novel substrate for sumoylation.